下列何種靜脈類麻醉藥物，具有支氣管擴張效果？
A. thiopental
B. ketamine
C. propofol
D. midazolam

正確答案：B. ketamine